Clinical trial exclusion criterion:
Known allergy/sensitivity or any hypersensitivity to components of study drugs or their formulation

Annotated entities:
- Condition: "allergy"
- Condition: "sensitivity"
- Condition: "hypersensitivity"
- Drug: "components of study drugs"